Clinical trial exclusion criterion:
Inpatient status, airway abnormalities, allergy to any study medications, eggs and soy, and mitochondrial disorders.

Entity relations:
- AND("allergy", "study medications")
- OR("study medications", "eggs", "soy")
- OR("Inpatient status", "allergy", "mitochondrial disorders", "airway abnormalities")